Clinical trial exclusion criterion:
Is pregnant or breast feeding or expecting to conceive or father starting from the first dose of study medication, throughout the study period, and for up to 120 days after the last dose of study medication

Entity relations:
- Has_index("starting from the first dose of study medication", "the first dose of study medication")
- Has_index("throughout the study period", "the study period")
- Has_index("for up to 120 days after the last dose of study medication", "the last dose of study medication")
- Has_temporal("expecting to father", "starting from the first dose of study medication")
- Has_temporal("expecting to father", "throughout the study period")
- Has_temporal("expecting to father", "for up to 120 days after the last dose of study medication")
- OR("pregnant", "breast feeding", "expecting to conceive", "expecting to father")